Clinical trial inclusion criterion:
Baseline anemia

Annotated entities:
- Condition: "anemia"
- Temporal: "Baseline"